Clinical trial inclusion criterion:
Patient has given written informed consent prior to any study-specific procedures. Patients with psychiatric or addictive disorders which prevent them from giving their informed consent must not enter the study.

Entity relations:
- Has_negation("giving informed consent", "prevent")
- Has_context("psychiatric disorders", "giving informed consent")
- OR("psychiatric disorders", "addictive disorders")